Clinical trial exclusion criterion:
Has had clinically diagnosed hepatic encephalopathy in the last 6 months

Entity relations:
- Has_temporal("hepatic encephalopathy", "in the last 6 months")